Systemic administration of corticosteroids (PO/IV/IM) within 90 days prior to informed consent.

The above is a clinical trial exclusion criterion. Annotated with entity spans:
[Qualifier: Systemic administration] of [Drug: corticosteroids] ([Qualifier: PO]/[Qualifier: IV]/[Qualifier: IM]) [Temporal: within 90 days prior to informed consent].